Which method is available for whole genome identification of pathogenic regulatory variants in mendelian disease?

Genomiser